Clinical trial inclusion criterion:
A primary complaint of pain in the area between the 12th rib and buttock crease without leg pain

Entity relations:
- Has_negation("leg pain", "without")
- Has_qualifier("pain", "area between the 12th rib and buttock crease")
- AND("pain", "leg pain")